Clinical trial exclusion criterion:
History or known presence of central nervous system (CNS) or spinal cord tumor (e.g., meningioma, glioma)

Entity relations:
- Subsumes("central nervous system (CNS) tumor", "meningioma")
- OR("meningioma", "glioma")
- OR("central nervous system (CNS) tumor", "spinal cord tumor")